Subjects with HIV positive result at the screening

The above is a clinical trial exclusion criterion. Annotated with entity spans:
Subjects with [Condition: HIV positive] result [Temporal: at the screening]